Clinical trial exclusion criterion:
Hemoglobin > 12g/dL

Entity relations:
- Has_value("Hemoglobin", "> 12g/dL")